Clinical trial exclusion criterion:
10. Presence of an active systemic or local cancer or tumor of any kind (with the exception of non-melanoma skin cancer)

Entity relations:
- Has_negation("non-melanoma skin cancer", "with the exception of")
- AND("systemic cancer", "non-melanoma skin cancer")
- Has_temporal("systemic cancer", "active")
- OR("systemic cancer", "local cancer", "tumor of any kind")